Clinical trial exclusion criterion:
Has received a live vaccine within 30 days prior to the first dose of study therapy

Annotated entities:
- Condition: "live vaccine"
- Temporal: "30 days prior"
- Reference_point: "first dose of study therapy"